Un plasma analítico se define como:
1. Una antorcha de cuarzo formada por tres tubos concéntricos a través de los cuales fluyen corrientes de argón y rodeada en la parte superior por una bobina de inducción.
2. Sistema de ionización consistente en aplicar un elevado potencial eléctrico a la salida del nebulizador de la muestra, la cual se vaporiza liberando iones en fase gaseosa.
3. Un gas parcialmente ionizado, a elevada temperatura, eléctricamente conductor, que contiene una elevada concentración de cationes y electrones.
4. Método de análisis por espectroscopia de emisión atómica, en el que la muestra es nebulizada e ionizada en un campo eléctrico donde adquiere una trayectoria de oscilación estable.

Respuesta correcta: 3. Un gas parcialmente ionizado, a elevada temperatura, eléctricamente conductor, que contiene una elevada concentración de cationes y electrones.